下列那一項是乳癌最常見之早期症狀？
A. 乳房痛
B. 乳頭分泌物
C. 乳房硬塊
D. 乳頭凹陷（retraction of nipple）

正確答案：C. 乳房硬塊